Awaiting cardiac transplantation or other cardiac surgery within the next 12 months (365 days)

The above is a clinical trial exclusion criterion. Annotated with entity spans:
Awaiting [Procedure: cardiac transplantation] or other [Procedure: cardiac surgery] [Temporal: within the next 12 months] (365 days)